Patients who are eligible for intracoronary stenting

The above is a clinical trial inclusion criterion. Annotated with entity spans:
Patients who are eligible for [Procedure: intracoronary stenting]